Clinical trial inclusion criterion:
physical status I - III

Annotated entities:
- Measurement: "physical status"
- Value: "I - III"